Karnofsky Performance Status > 60

The above is a clinical trial inclusion criterion. Annotated with entity spans:
[Measurement: Karnofsky Performance Status] [Value: > 60]